Clinical trial inclusion criterion:
Patients with STEMI undergoing primary PPCI

Entity relations:
- AND("STEMI", "primary PPCI")